Stable pharmacological therapy during the last 4 weeks (with the exception of diuretics)

The above is a clinical trial inclusion criterion. Annotated with entity spans:
[Qualifier: Stable] [Procedure: pharmacological therapy] [Temporal: during the last 4 weeks] ([Negation: with the exception of] [Drug: diuretics])